Which syndrome is caused by dysfunction of the ciliary ARMC9/TOGARAM1 protein?

Joubert syndrome is a rare autosomal recessive disorder caused by dysfunction of the ciliary ARMC9/TOGARAM1 protein.